History of developmental disorder or IQ score < 70

The above is a clinical trial exclusion criterion. Annotated with entity spans:
History of [Condition: developmental disorder] or [Measurement: IQ score] [Value: < 70]